Clinical trial exclusion criteria:
1. Orthopedic injuries that are unstable
2. Osteoporosis with high risk of pathological fracture
3. Cutaneous lesions and/or pressure ulcers
4. Joint contractures
5. Cardiopulmonary diseases
6. Body weight exceeding 150 Kg

Annotated entities:
- Parsing_Error: "1."
- Condition: "Orthopedic injuries"
- Qualifier: "unstable"
- Parsing_Error: "2."
- Condition: "Osteoporosis"
- Qualifier: "high risk of pathological fracture"
- Subjective_judgement: "high risk of pathological fracture"
- Undefined_semantics: "high risk of pathological fracture"
- Non-query-able: "high risk of pathological fracture"
- Parsing_Error: "3."
- Condition: "Cutaneous lesions"
- Condition: "pressure ulcers"
- Parsing_Error: "4."
- Condition: "Joint contractures"
- Parsing_Error: "5."
- Condition: "Cardiopulmonary diseases"
- Parsing_Error: "6."
- Measurement: "Body weight"
- Value: "exceeding 150 Kg"